Clinical trial inclusion criterion:
2. ST elevation in 2 contiguous ECG leads (= 2 mm precordial lead, = 1 mm limb lead). This ECG recording serves as baseline ECG, i.e. ECG I.

Entity relations:
- Has_value("precordial lead", "2 mm")
- Has_value("limb lead", "1 mm")
- Has_value("contiguous ECG leads", "2")
- Subsumes("contiguous ECG leads", "precordial lead")
- AND("ST elevation", "contiguous ECG leads")